Clinical trial exclusion criterion:
Serious tear film dysfunction syndrome TBUT < 5 s Schirmer: < 4 mm OSDI > 30 pints Corneal staining > grade III on the Oxford scale

Annotated entities:
- Condition: "Serious tear film dysfunction syndrome"
- Measurement: "TBUT"
- Line: "Serious tear film dysfunction syndrome"
- Value: "< 5 s"
- Measurement: "Schirmer"
- Value: "< 4 mm"
- Measurement: "OSDI"
- Value: "> 30 pints"
- Measurement: "Corneal staining"
- Value: "> grade III"
- Qualifier: "Oxford scale"
- Line: "TBUT < 5 s"
- Line: "Schirmer: < 4 mm"
- Line: "OSDI > 30 pints"
- Line: "Corneal staining > grade III on the Oxford scale"